Clinical trial exclusion criterion:
allergy to eggs

Entity relations:
- AND("allergy", "eggs")